Clinical trial inclusion criterion:
Residual clinically or radiographically evident tumor, including primary cutaneous and mucosal melanomas

Entity relations:
- Has_value("radiographically", "evident")
- Has_qualifier("clinically", "Residual")
- AND("tumor", "clinically")
- Subsumes("clinically", "primary cutaneous")
- OR("clinically", "radiographically")
- OR("primary cutaneous", "mucosal melanomas")